Where do centromeres locate according to the Rabl orientation of eukaryotic nuclei?

This was taken as good evidence for the maintenance of the chromosome arrangement - the Rabl orientation - and of the peripheral location of the centromere and its association with the nuclear membrane.